以下何者不是子宮內膜癌（endometrial carcinoma）的危險因子？
A. 肥胖
B. 使用tamoxifen治療乳癌
C. 單獨使用estrogen來治療停經後症候群
D. 使用progestin治療不孕症

正確答案：D. 使用progestin治療不孕症